Clinical trial inclusion criterion:
All patients subjected to deep sedation in ambulant care, having a colonoscopy

Annotated entities:
- Procedure: "deep sedation"
- Visit: "ambulant"
- Procedure: "colonoscopy"